previous thoracic surgery

The above is a clinical trial exclusion criterion. Annotated with entity spans:
[Temporal: previous] [Procedure: thoracic surgery]